Use of other investigational study drugs within 1 year prior to study entry

The above is a clinical trial exclusion criterion. Annotated with entity spans:
Use of other [Drug: investigational study drugs] [Temporal: within 1 year prior to study entry]